What percentage of C. elegans genes reside in operons?

Evidence indicates that the genome of C. elegans contains at least 1,000 operons, 2 8 genes long, that contain about 15% of all C. elegans genes.